Diagnosis of diabetes mellitus

The above is a clinical trial inclusion criterion. Annotated with entity spans:
Diagnosis of [Condition: diabetes mellitus]